成人的脊髓尾端相對應於何段脊椎處？
A. 第九至第十胸椎間
B. 第一至第二腰椎間
C. 第五腰椎至第一薦椎間
D. 第二薦椎至第二尾椎間

正確答案：B. 第一至第二腰椎間